Clinical trial exclusion criterion:
Patient with history of osteomyelitis/septic arthritis

Entity relations:
- OR("osteomyelitis", "septic arthritis")